Clinical trial exclusion criterion:
Insulin-treated Subjects

Annotated entities:
- Drug: "Insulin"